Clinical trial exclusion criterion:
Clinically infected ulcer

Annotated entities:
- Condition: "infected ulcer"